下列有關神經元（neuron）對受傷（injury）後反應的敘述，何者錯誤？
A. 在神經受傷處遠端的軸突（axon）會出現順行性退化（anterograde degeneration）
B. 神經損傷導致神經元細胞體內尼氏小體（Nissl body）的消失，稱為染色質溶解（chromatolysis）
C. 在周邊神經系統，於神經受傷處會有單核球衍生之吞噬細胞（monocyte-derived macrophage）的聚集
D. 在中樞神經系統，於神經受傷處主要由寡樹突膠細胞（oligodendrocyte）負責髓鞘（myelin）的分解清除

正確答案：D. 在中樞神經系統，於神經受傷處主要由寡樹突膠細胞（oligodendrocyte）負責髓鞘（myelin）的分解清除